Clinical trial inclusion criterion:
3. A documented history of severe Symptomatic Orthostatic Hypotension (SOH) that, in the judgment of the treating physician, has required treatment with midodrine HCl , and has been at a stable dose for at least 3 months.

Annotated entities:
- Condition: "Symptomatic Orthostatic Hypotension (SOH)"
- Qualifier: "severe"
- Drug: "midodrine HCl"
- Qualifier: "stable dose"
- Temporal: "for at least 3 months"